Corrected visual acuity < 20/70; Color blindness.

The above is a clinical trial exclusion criterion. Annotated with entity spans:
[Qualifier: Corrected] [Measurement: visual acuity] [Value: < 20/70;] [Condition: Color blindness].